Clinical trial exclusion criteria:
Active substance dependency
History of severe head injury

Annotated entities:
- Condition: "substance dependency"
- Condition: "severe head injury"
- Temporal: "History"